Clinical trial exclusion criteria:
1. For subjects in Cohort A: previous therapy for more than 48 hours with any parenteral antibiotic with activity against S. aureus within 72 hours of positive blood culture results.
2. For subjects in Cohort B: previous therapy for more than 48 hours with any parenteral antibiotic with activity against MRSA, except vancomycin and/or daptomycin, within 72 hours of positive blood culture results confirming persistence.
3. Previous episode of S. aureus bacteremia within 3 months.
4. Known left-sided endocarditis or prosthetic heart valve.
5. Osteomyelitis or prosthetic joint infection except new onset nonhardware-associated vertebral osteomyelitis.
6. History of any hypersensitivity or allergic reaction to any β-lactam antibacterial agent.
7. Evidence of significant hepatic, hematologic, or immunologic impairment.
8. Pregnant or nursing females.

Annotated entities:
- Observation: "Cohort A"
- Non-query-able: "Cohort A"
- Procedure: "therapy"
- Undefined_semantics: "therapy"
- Temporal: "previous"
- Temporal: "for more than 48 hours"
- Drug: "parenteral antibiotic with activity against S. aureus"
- Qualifier: "with activity against S. aureus"
- Observation: "S. aureus"
- Temporal: "within 72 hours of positive blood culture results"
- Reference_point: "positive blood culture results"
- Procedure: "blood culture"
- Value: "positive results"
- Qualifier: "parenteral"
- Observation: "Cohort B"
- Non-query-able: "Cohort B"
- Temporal: "previous"
- Procedure: "therapy"
- Undefined_semantics: "therapy"
- Temporal: "for more than 48 hours"
- Drug: "parenteral antibiotic with activity against MRSA"
- Qualifier: "parenteral"
- Qualifier: "with activity against MRSA"
- Observation: "MRSA"
- Drug: "vancomycin"
- Negation: "except"
- Drug: "daptomycin"
- Temporal: "within 72 hours of positive blood culture results"
- Reference_point: "positive blood culture results"
- Value: "positive results"
- Procedure: "blood culture"
- Condition: "S. aureus bacteremia"
- Observation: "S. aureus"
- Qualifier: "S. aureus"
- Temporal: "within 3 months"
- Condition: "left-sided endocarditis"
- Qualifier: "left-sided"
- Device: "prosthetic heart valve"
- Condition: "Osteomyelitis"
- Condition: "prosthetic joint infection"
- Temporal: "new onset"
- Qualifier: "nonhardware-associated"
- Condition: "vertebral osteomyelitis"
- Negation: "except"
- Condition: "hypersensitivity"
- Condition: "allergic reaction"
- Drug: "β-lactam antibacterial agent"
- Temporal: "History"
- Condition: "hepatic impairment"
- Condition: "immunologic impairment"
- Condition: "hematologic impairment"
- Condition: "Pregnant"
- Condition: "nursing"
- Person: "females"